Clinical trial exclusion criterion:
Use of oral or intravaginal antibiotics within the past 2 weeks

Annotated entities:
- Drug: "intravaginal antibiotics"
- Drug: "oral antibiotics"
- Temporal: "within the past 2 weeks"